Clinical trial exclusion criterion:
Positive hepatitis B surface antigen, positive hepatitis C antibody or positive HIV test at screening or a history of positive testing (e.g. liver biopsy, serology) suggesting acute or chronic hepatitis.

Annotated entities:
- Measurement: "hepatitis B surface antigen"
- Value: "Positive"
- Measurement: "hepatitis C antibody"
- Value: "positive"
- Measurement: "HIV test"
- Value: "positive"
- Temporal: "at screening"
- Reference_point: "screening"
- Temporal: "history"
- Procedure: "liver biopsy"
- Procedure: "serology"
- Procedure: "testing"
- Value: "positive"
- Undefined_semantics: "testing"
- Context_Error: "testing"
- Condition: "chronic hepatitis"
- Condition: "acute hepatitis"